En un patrón de electroforesis de proteínas plasmáticas, ¿en qué región migrará la haptoglobina?
1. En la región 1.
2. En la región .
3. En la región 2.
4. En la región 1 2.
5. En ninguna puesto que no se trata de una proteína.

Respuesta correcta: 3. En la región 2.